一位20歲運動員參加馬拉松比賽約2小時後因昏倒與痙攣被救護車送醫治療。抵達醫院時，意識呈昏迷，心 	跳每分	120次，血壓98/52毫米汞柱（mmHg），體溫攝氏40.8度。驗血發現：aspartate aminotransferase
 （AST）110 U/L、alanine aminotransferase（ALT）123 U/L、肌酸酐（creatinine）2.2 mg/dL、鈉143 
 mmol/L、鉀4.7 mmol/L、鈣2.4 mmol/L、葡萄糖75 mg/dL。病人過去健康情況良好，比賽前無不適症狀。比賽當日氣溫為攝氏37度。請依前述情況回答下列3題。此病人最可能的診斷為何？
A. 熱痙攣（heat cramps）
B. 熱衰竭（heat exhaustion）
C. 中暑（heat stroke）
D. 熱昏厥（heat syncope）

正確答案：C. 中暑（heat stroke）